Clinical trial exclusion criterion:
Inflammatory bowel disease.

Annotated entities:
- Condition: "Inflammatory bowel disease"